Active self harm urges

The above is a clinical trial exclusion criterion. Annotated with entity spans:
[Temporal: Active] [Condition: self harm urges]